Respecto a la técnica de moldeamiento, ¿cuál de las siguientes características es VERDADERA?
1. Se requiere un ambiente estructurado.
2. Se puede llevar a cabo hacia delante y hacia atrás.
3. Implica la aplicación sucesiva del reforzamiento y la extinción.
4. Las aproximaciones sucesivas forman parte necesariamente de la conducta final.
5. La conducta meta puede ser simple o compleja.

Respuesta correcta: 3. Implica la aplicación sucesiva del reforzamiento y la extinción.